一位 25 歲女性，由於小學六年級時曾被狗咬過，所以非常怕狗，她因而不敢獨自外出，更害怕到任何有狗的地方，而出現人際退縮，也無法外出謀職。她了解到這些害怕是太過度了，但又苦惱於不知如何改變。下列有關此個案的治療，何者錯誤？
A. 藥物治療效果最佳
B. 心理治療能協助個案了解畏懼的原因，而鼓勵個案尋求進一步的治療
C. 催眠、支持性治療與家庭治療或許也有助益
D. 此類問題以行為治療為主，系統性減敏感法（systematic desensitization）為最常使用的方法

正確答案：A. 藥物治療效果最佳